1. The patient is pregnant or breastfeeding.

The above is a clinical trial exclusion criterion. Annotated with entity spans:
1. The patient is [Condition: pregnant] or [Observation: breastfeeding].